Clinical trial inclusion criteria:
No response to more than one antiarrhythmic drug, or unwilling to receive long-term drug treatment.
Can provide informed consent form expressing willingness to participate in the study and comply with follow-up tests and evaluation procedures.
Aged 18-80 years.

Annotated entities:
- Drug: "antiarrhythmic drug"
- Condition: "response"
- Negation: "No"
- Multiplier: "more than one"
- Non-query-able: "or unwilling to receive long-term drug treatment."
- Post-eligibility: "Can provide informed consent form expressing willingness to participate in the study and comply with follow-up tests and evaluation procedures."
- Person: "Aged"
- Value: "18-80 years"